Clinical trial inclusion criterion:
Lower left ventricular ejection fraction 45% (LVEF <45%) assessed by simple and recent echocardiogram;

Entity relations:
- Has_value("Lower left ventricular ejection fraction", "45%")
- Has_value("LVEF", "<45%")
- Subsumes("Lower left ventricular ejection fraction", "LVEF")
- AND("echocardiogram", "Lower left ventricular ejection fraction")
- Has_temporal("echocardiogram", "recent")